Un adolescente, ante la pregunta de por qué NO se puede robar, contesta “porque pueden verte, denunciarte a la policía y podrías ir a la cárcel”. Según Kohlberg ¿Qué nivel de desarrollo moral está demostrando ese adolescente?:
1. Convencional.
2. Preconvencional.
3. Orientado a la ley.
4. Orientado a principios individuales.

Respuesta correcta: 2. Preconvencional.